Clinical trial inclusion criterion:
3. Weighing at least 50 kg

Entity relations:
- Has_value("Weighing", "at least 50 kg")